下列有關粒線體 ATP 合成酶（ATP synthase）的敘述，何者正確？
A. 它含有 F0 及 F1 次單元（subunit），二者皆可穿透粒線體的胞膜
B. 它單獨在水溶液中仍可以合成 ATP
C. 它只能水解 ATP
D. 當它催化 ATP 合成時，其標準自由能變化（∆G'o ）事實上是接近於零

正確答案：D. 當它催化 ATP 合成時，其標準自由能變化（∆G'o ）事實上是接近於零